50歲劉先生因胃癌，1個半月前接受根除性次全胃切除手術（radical subtotal gastrectomy & Billroth-II gastrojejunostomy,  ante-colic，病理檢查為T2b N1M0。恢復過程順利，術後10天出院。兩天前腹部不適，3小時前開始腹痛加劇及嘔吐，急診時生命徵象穩定，但冒冷	。身體檢查上腹部有明顯壓痛，疑似觸摸到腹部腫塊，腸蠕動增加，除serum amylase 867 U/L，
 /mm3外，血液檢查正常。放入鼻胃管後只有少量胃液回流，此時最可能的診斷為何？
A. gastric cancer recurrence
B. anastomotic leakage
C. acute pancreatitis
D. afferent loop syndrome

正確答案：D. afferent loop syndrome